4. Capable of providing informed consent.

The above is a clinical trial inclusion criterion. Annotated with entity spans:
4. [Post-eligibility: Capable of providing informed consent.]